類固醇在腎上腺皮質生成皮質醇（cortisol）的速率限制步驟（rate-limiting step）為：
A. 膽固醇進入粒線體內膜
B. 助孕酮（progesterone）→皮質醇（cortisol）
C. 助孕酮→雄性素（androgen）
D. 睪固酮（testosterone）→動情素（estrogen）

正確答案：A. 膽固醇進入粒線體內膜